Clinical trial exclusion criterion:
Subjects with uncontrolled intercurrent illness .

Annotated entities:
- Undefined_semantics: "Subjects with uncontrolled intercurrent illness"